Patient has provided written informed consent.

The above is a clinical trial inclusion criterion. Annotated with entity spans:
[Informed_consent: Patient has provided written informed consent].